一位 68 歲農夫 2 年前就發現鼻樑上有個結實的小腫瘤，他注意到該小腫瘤慢慢長大，目前約 1 公分且中央有個小潰瘍，就醫後接受腫瘤全切除，並做了鼻樑修補手術。下列各種輻射線何者與該腫瘤關係最密切？
A. X 射線
B. γ 射線
C. 紫外線
D. 紅外線

正確答案：C. 紫外線